Clinical trial exclusion criterion:
Acute or chronic pain requiring opioid treatment

Annotated entities:
- Qualifier: "Acute"
- Qualifier: "chronic"
- Condition: "pain"
- Procedure: "opioid treatment"